HbA1c = 6.5 and = 10.0 %

The above is a clinical trial inclusion criterion. Annotated with entity spans:
[Measurement: HbA1c] [Value: = 6.5 and = 10.0 %]